Clinical trial exclusion criterion:
previous brain surgery;

Annotated entities:
- Temporal: "previous"
- Procedure: "brain surgery"